Clinical trial exclusion criterion:
diagnosed advanced heart, kidney or liver failure

Entity relations:
- OR("advanced heart failure", "kidney failure", "liver failure")